Clinical trial inclusion criterion:
Have diagnosis of prostate cancer and have received treatment with GnRH agonist or antagonist therapy for at least 1 month prior to enrollment.

Annotated entities:
- Condition: "prostate cancer"
- Drug: "GnRH agonist"
- Drug: "GnRH antagonist"
- Multiplier: "for at least 1 month"
- Temporal: "prior to enrollment"
- Procedure: "treatment"